Clinical trial exclusion criterion:
Progressive neurological disease

Annotated entities:
- Condition: "neurological disease"
- Qualifier: "Progressive"